El trofoblasto se desarrolla a partir de:
1. La capa externa del blastocisto.
2. La masa celular interna.
3. La zona pelúcida.
4. El disco germinativo bilaminar.
5. El endometrio.

Respuesta correcta: 1. La capa externa del blastocisto.